exposure to altitudes >1500m for >2 days within the last 4 weeks before the study.

The above is a clinical trial exclusion criterion. Annotated with entity spans:
[Non-query-able: exposure to altitudes >1500m for >2 days within the last 4 weeks before the study.]